已知 ammonia 對細胞具有毒性，在肝硬化而進入肝昏迷的病人，經常檢驗血中 ammonia 之濃度作為病情進展的指標，下列何者與 ammonia 的代謝清除反應無直接關係？
A. leucine
B. pyruvate
C. glutamate
D. α-ketoglutarate

正確答案：A. leucine